Una prueba importante para diferenciar Staphylococcus aureus de Staphylococcus epidermidis es la detección de:
1. Catalasa.
2. Coagulasa.
3. Utilización de citrato.
4. Reducción de nitrato.

Respuesta correcta: 2. Coagulasa.